下列副甲狀腺疾病中，何者最常造成四粒副甲狀腺同時發生病變？
A. 腺瘤（adenoma）
B. 增生（hyperplasia）
C. 癌（carcinoma）
D. 感染（infection）

正確答案：B. 增生（hyperplasia）